下列何種疫苗為口服劑型？
A. A型肝炎疫苗（Hepatitis A vaccine）
B. 輪狀病毒疫苗（Rotavirus vaccine）
C. 卡介苗（BCG vaccine）
D. 水痘疫苗（Varicella vaccine）

正確答案：B. 輪狀病毒疫苗（Rotavirus vaccine）